¿Por qué es verde la clorofila?:
1. Absorbe todas las longitudes de onda del espectro visible.
2. Absorbe longitudes de onda solo de las partes roja y ultrarroja del espectro (680nm, 700nm).
3. Absorbe longitudes de onda en las partes roja y azul del espectro visible.
4. Absorbe longitudes de onda solo de la parte azul del espectro visible.
5. Absorbe en el ultravioleta próximo.

Respuesta correcta: 3. Absorbe longitudes de onda en las partes roja y azul del espectro visible.